Clinical trial inclusion criterion:
Patient has experienced lower urinary tract symptoms (LUTS) for at least 6 months prior to study enrollment

Entity relations:
- Has_index("at least 6 months prior to study enrollment", "study enrollment")
- Has_temporal("lower urinary tract symptoms (LUTS)", "at least 6 months prior to study enrollment")